在結腸直腸癌（colorectal carcinoma）的腫瘤細胞中，最不可能出現以下何種變化？
A. 內分泌分化（endocrine differentiation）
B. 腺體分化（glandular differentiation）
C. 肌肉性分化（muscular differentiation）
D. 鱗狀細胞分化（squamous cell differentiation）

正確答案：C. 肌肉性分化（muscular differentiation）